Clinical trial exclusion criterion:
Inability to swallow oral medication

Annotated entities:
- Drug: "oral medication"
- Condition: "Inability to swallow oral medication"